分化良好的甲狀腺癌其頸部淋巴結轉移，依統計以那一區最常見及那一區最少見？
A. 第一區（level I）及第二區（level II）
B. 第三區（level III）及第四區（level IV）
C. 第五區（level V）及第六區（level VI）
D. 第六區（level VI）及第一區（level I）

正確答案：D. 第六區（level VI）及第一區（level I）